Human Immunodeficiency Virus (HIV)

The above is a clinical trial exclusion criterion. Annotated with entity spans:
[Condition: Human Immunodeficiency Virus (HIV)]